Clinical trial exclusion criterion:
Previous diabetic history, coronary artery disease

Entity relations:
- Has_temporal("diabetic", "history")
- Has_temporal("diabetic", "Previous")
- OR("diabetic", "coronary artery disease")